負壓輔助傷口治療（negative pressure-assisted wound therapy, NPWT）是傷口治療方法之一，下列敘述何者錯誤？
A. NPWT可以改善傷口微環境（microenvironment），可促進傷口癒合
B. NPWT利用機器反覆壓縮放鬆（compression and relaxation）的原理，刺激傷口組織，可增加生長因子的
C. NPWT可適用於多種開放性傷口
D. NPWT治療，不會改變傷口的面積

正確答案：D. NPWT治療，不會改變傷口的面積